Clinical trial exclusion criterion:
History of claustrophobia

Annotated entities:
- Condition: "claustrophobia"
- Temporal: "History"